age less than 40 or over 80 years

The above is a clinical trial exclusion criterion. Annotated with entity spans:
[Person: age] [Value: less than 40] or [Value: over 80 years]